Pain on hip or ankle

The above is a clinical trial exclusion criterion. Annotated with entity spans:
[Condition: Pain] on [Qualifier: hip] or [Qualifier: ankle]